CAD

The above is a clinical trial exclusion criterion. Annotated with entity spans:
[Condition: CAD]